甲狀腺風暴（thyroid storm）不宜給與何種治療？
A. beta抑制劑（beta blockers）
B. amiodarone
C. 腎上腺皮質素（corticosteroids）
D. propylthiouracil

正確答案：B. amiodarone